有關白黴菌病之黴菌性鼻竇炎之敘述，何者錯誤？
A. 易發生於嚴重酸中毒或免疫受抑制病人身上
B. 常併顏面神經麻痺
C. 造成之血管性栓塞包含黑色的鼻甲及帶棕色水樣排出液
D. 眼眶的徵象常見波及第三、四及六對顱神經

正確答案：B. 常併顏面神經麻痺